Clinical trial inclusion criterion:
Imaging evidence of new or presumed new loss of viable myocardium or regional wall motion abnormality.

Entity relations:
- AND("Imaging", "evidence")
- Has_multiplier("evidence", "new")
- AND("evidence", "loss of viable myocardium")
- OR("new", "presumed new")
- OR("loss of viable myocardium", "regional wall motion abnormality")